Life expectancy less than 360 days (12 months)

The above is a clinical trial exclusion criterion. Annotated with entity spans:
[Observation: Life expectancy] [Value: less than 360 days] (12 months)